有關雌激素（estrogen）用於停經婦女的補充治療之敘述，下列何者正確？
A. 會使骨質疏鬆症（osteoporosis）惡化
B. 會增加子宮內膜癌（endometrial carcinoma）發生的機率
C. 會誘發熱潮紅（hot flushes）的產生
D. 會增加血漿中低密度脂蛋白膽固醇（low-density lipoprotein cholesterol; LDL）和減少高密度脂蛋白膽固醇

正確答案：B. 會增加子宮內膜癌（endometrial carcinoma）發生的機率